Clinical trial exclusion criterion:
Contraindication to aspirin

Annotated entities:
- Condition: "Contraindication"
- Drug: "aspirin"